El fibrinógeno se activa por:
1. Tapón plaquetario.
2. Plasmina.
3. Trombina.
4. Tromboplastina.
5. Factor von Willebrand.

Respuesta correcta: 3. Trombina.